What causes Ocular Thelaziasis?

Ocular Thelaziasis is caused by Thelazia callipaeda.